Clinical trial exclusion criterion:
Concomitant use of NSAIDS, ASA, and other anticoagulants.

Annotated entities:
- Drug: "NSAIDS"
- Drug: "ASA"
- Drug: "anticoagulants"
- Qualifier: "other"
- Temporal: "Concomitant"